En el síndrome coronario agudo con elevación del segmento ST, la heparina se utiliza porque:
1. Es fibrinolítica, ya que destruye el trombo.
2. Inhibe la formación de más trombos y evita su recurrencia.
3. Inhibe la agregación plaquetaria.
4. Restaura la permeabilidad de la arteria coronaria de forma inmediata.
5. Todas las respuestas anteriores son correctas.

Respuesta correcta: 2. Inhibe la formación de más trombos y evita su recurrencia.